Unidimensional or bi-dimensional measurable disease

The above is a clinical trial inclusion criterion. Annotated with entity spans:
[Non-query-able: Unidimensional or bi-dimensional measurable disease]